Patients who have normal liver function and renal function.

The above is a clinical trial inclusion criterion. Annotated with entity spans:
Patients who have [Qualifier: normal] [Condition: liver function] and [Condition: renal function].